Leukopenia (WBC < 3000 cell/mL), acute anemia (Hgb < 9 g/dL), Thrombocytopenia (Plt < 50,000 cell/mL).

The above is a clinical trial exclusion criterion. Annotated with entity spans:
[Condition: Leukopenia] ([Measurement: WBC] [Value: < 3000 cell/mL]), [Condition: acute anemia] ([Measurement: Hgb] [Value: < 9 g/dL]), [Condition: Thrombocytopenia] ([Measurement: Plt] [Value: < 50,000 cell/mL]).